下列何者對於抑制胃的活動力（motility）與排空（emptying）作用最強？
A. 胃內僅含碳水化合物之食物
B. 胃壁擴張
C. 進入十二指腸內之高脂食物
D. 胃泌素（gastrin）

正確答案：C. 進入十二指腸內之高脂食物